Clinical trial exclusion criterion:
Significant hepatic disease

Entity relations:
- Has_qualifier("hepatic disease", "Significant")